Continuous HAs of any kind (i.e., persistent daily HAs with no HA-free period less than 8 hours between attacks)

The above is a clinical trial exclusion criterion. Annotated with entity spans:
[Qualifier: Continuous] [Condition: HAs] of any kind (i.e., [Qualifier: persistent] [Multiplier: daily] [Condition: HAs] with [Negation: no] [Measurement: HA-free period] [Value: less than 8 hours] between attacks)